Clinical trial exclusion criterion:
Malignancy(diagnosed or under investigation)

Entity relations:
- AND("diagnosed", "Malignancy")
- OR("diagnosed", "under investigation")